Clinical trial inclusion criterion:
ECOG performance status of 0,1, or 2.

Annotated entities:
- Measurement: "ECOG performance status"
- Value: "0"
- Value: "0,1"
- Value: "."